Clinical trial inclusion criteria:
Undergoing mid-urethral sling surgery
Have symptoms of both stress and urgency urinary incontinence
Able to consent, fill out study documents, and complete all study procedures and follow-up visits
At least 18 years of age
English speaking
Be able and willing to learn clean intermittent self catheterization technique

Annotated entities:
- Procedure: "mid-urethral sling surgery"
- Condition: "urgency urinary incontinence"
- Condition: "stress urinary incontinence"
- Post-eligibility: "Able to consent, fill out study documents, and complete all study procedures and follow-up visits"
- Person: "age"
- Value: "At least 18 years"
- Non-query-able: "English speaking"
- Non-query-able: "Be able and willing to learn clean intermittent self catheterization technique"